16. Men who are unwilling to use contraception if their partners are of childbearing potential

The above is a clinical trial exclusion criterion. Annotated with entity spans:
16. [Person: Men] who are [Mood: unwilling] to use [Drug: contraception] if [Observation: their partners are of childbearing potential]